Which SWI/SNF protein complex subunit has been demonstrated to interact with the FANCA gene product?

The Fanconi anemia protein FANCA has been shown to interact with the brm-related gene 1 (BRG1) product. BRG1 is a subunit of the SWI/SNF complex, which remodels chromatin structure through a DNA-dependent ATPase activity.